Clinical trial inclusion criteria:
Subjects who voluntarily consented, after listening enough explanation for this study and investigational product.
Adult over 50 years of age.
At least one of the knee pain VAS score is 40mm or more.
Patients who require medication for more than 12 weeks due to osteoarthritis symptoms.
Those who are able to follow the requirements of this clinical trial, such as being able to trace during the clinical trial period and to read and write the VAS questionnaire.
Those who weigh more than 40kg

Annotated entities:
- Informed_consent: "Subjects who voluntarily consented, after listening enough explanation for this study and investigational product."
- Person: "Adult"
- Value: "over 50 years"
- Person: "age"
- Multiplier: "At least one"
- Condition: "knee pain"
- Measurement: "VAS score"
- Value: "40mm or more"
- Drug: "medication"
- Multiplier: "more than 12 weeks"
- Condition: "osteoarthritis symptoms"
- Non-query-able: "Those who are able to follow the requirements of this clinical trial, such as being able to trace during the clinical trial period and to read and write the VAS questionnaire."
- Measurement: "weigh"
- Value: "more than 40kg"